Clinical trial exclusion criterion:
Pregnancy and lactation

Entity relations:
- OR("Pregnancy", "lactation")